La protección de un grupo funcional, susceptible de hidrolizarse, mediante la formación de un complejo constituye un procedimiento de estabilización de fármacos en disolución. Entre los excipientes utilizados con este fin se encuentran aquellos que están constituidos por distintos monómeros de glucosa con disposición cíclica y que se denominan:
1. Ciclodextrinas.
2. Sorbitoles.
3. Citratos.
4. Glucuronatos.
5. Propilenglicoles.

Respuesta correcta: 1. Ciclodextrinas.